藍嬰症（blue baby）是飲水中含有過量的何種物質所引起？
A. 硝酸鹽
B. 氟化物
C. 硫酸鹽
D. 碳酸鹽

正確答案：A. 硝酸鹽